Patients with chronic heart failure of New York Heart Association Class II or III, a left ventricular ejection fraction of = 40% for patients in NYHA class II or = 45% for patients in NYHA class III, a hemoglobin level at the screening visit between 9.5-13.5 g/dl, and iron deficiency, which is defined as serum ferritin level < 100µg/l or between 100 and 299 µg/l, when transferring saturation is < 20%.

The above is a clinical trial inclusion criterion. Annotated with entity spans:
Patients with [Condition: chronic heart failure] of [Measurement: New York Heart Association] [Value: Class II or III], a [Measurement: left ventricular ejection fraction] of [Value: = 40%] for patients in [Measurement: NYHA] [Value: class II] or [Value: = 45%] for patients in [Measurement: NYHA] [Value: class III], a [Measurement: hemoglobin level] [Temporal: at the screening visit] [Value: between 9.5-13.5 g/dl], and [Condition: iron deficiency], which is defined as [Measurement: serum ferritin level] [Value: < 100µg/l] or [Value: between 100 and 299 µg/l], when [Measurement: transferring saturation] is [Value: < 20%].